Clinical trial exclusion criterion:
Donation blood or serum within 8 weeks before the first dose administration to a blood bank or blood donation center.

Annotated entities:
- Procedure: "Donation blood"
- Grammar_Error: "Donation blood"
- Procedure: "Donation serum"
- Grammar_Error: "Donation serum"
- Temporal: "within 8 weeks before"
- Reference_point: "first dose administration"